Clinical trial exclusion criterion:
Treatment with class I or III antiarrhythmic drugs

Entity relations:
- Has_qualifier("antiarrhythmic drugs", "class I")
- OR("class I", "class III")